Clinical trial exclusion criterion:
Have a CD4 cell count of 50 cells/mm3or less

Annotated entities:
- Measurement: "CD4 cell count"
- Value: "50 cells/mm3or less"